What is the interaction between WAPL and PDS5 proteins?

we propose that wapl and pds5 directly modulate conformational changes of cohesin to make it competent for dissolving from chromatin during prophase